Clinical trial exclusion criterion:
Surgery with major complication, or need blood transfusion.

Entity relations:
- Has_mood("blood transfusion", "need")
- AND("Surgery", "major complication")
- OR("major complication", "blood transfusion")